significant musculoskeletal or cardiopulmonary diseases;

The above is a clinical trial exclusion criterion. Annotated with entity spans:
[Qualifier: significant] [Condition: musculoskeletal] or [Condition: cardiopulmonary diseases];